Clinical trial exclusion criterion:
Anaemia, defined as Hb <9g/dl

Entity relations:
- Has_value("Hb", "<9g/dl")
- AND("Anaemia", "Hb")